Clinical trial inclusion criterion:
Signed informed consent

Annotated entities:
- Observation: "Signed informed consent"